Patients with any other primary DSM-IV psychiatric diagnosis in addition to Obsessive Compulsive Disorder.

The above is a clinical trial exclusion criterion. Annotated with entity spans:
Patients with [Qualifier: any other] [Qualifier: primary] [Qualifier: DSM-IV] [Condition: psychiatric diagnosis] [Negation: in addition to] [Condition: Obsessive Compulsive Disorder].